Patient with a high or very high cardiovascular risk treated by lipidlowering therapy with statin

The above is a clinical trial inclusion criterion. Annotated with entity spans:
Patient with a [Qualifier: high] or [Qualifier: very high] [Condition: cardiovascular risk] treated by [Procedure: lipidlowering therapy] with [Drug: stati]n